75歲男性病人，因多年來有運動時呼吸困難現象，前來醫院就診。就診時沒有發燒，身體診查發現有兩手有杵狀指（clubbing fingers），且聽診時可聽到兩側下肺野有細囉音（fine crackles），下列何種疾病為最可能的診斷？
A. 肺纖維化症
B. 肺水腫
C. 肺炎
D. 肺癌

正確答案：A. 肺纖維化症